recurrent severe hypoglycemic episodes or high glucose variability

The above is a clinical trial inclusion criterion. Annotated with entity spans:
[Multiplier: recurrent] [Qualifier: severe] [Condition: hypoglycemic episodes] or [Condition: high glucose variability]